Patients included in another trial or having been given investigational drugs within 12 weeks prior to screening

The above is a clinical trial exclusion criterion. Annotated with entity spans:
[Post-eligibility: Patients included in another trial or having been given investigational drugs within 12 weeks prior to screening]